下列那一個胺基酸不會吸收波長為280 nm的紫外光？
A. 苯丙胺酸（phenylalanine）
B. 天冬醯胺（asparagine）
C. 酪胺酸（tyrosine）
D. 色胺酸（tryptophan）

正確答案：B. 天冬醯胺（asparagine）